Clinical trial inclusion criterion:
Subject has any open wounds.

Annotated entities:
- Condition: "open wounds"